¿Cuál sería el mecanismo fisiopatológico que explicaría la ictericia que puede observarse en la coledocolitiasis?
1. Aumento en la producción de bilirrubina.
2. Defecto en la captación de bilirrubina por el hepatocito.
3. Trastorno en la conjugación de bilirrubina.
4. Defecto en la eliminación de bilirrubina por el hepatocito.
5. Trastorno en la conducción de bilirrubina hacia el duodeno.

Respuesta correcta: 5. Trastorno en la conducción de bilirrubina hacia el duodeno.